Clinical trial inclusion criterion:
Has chronic back pain of =3 months duration by history

Annotated entities:
- Condition: "chronic back pain"
- Qualifier: "=3 months duration"
- Temporal: "history"
- Measurement: "duration"
- Value: "=3 months"